8. Creatine kinase above ULN

The above is a clinical trial exclusion criterion. Annotated with entity spans:
[Parsing_Error: 8.] [Measurement: Creatine kinase] [Value: above ULN]